Clinical trial exclusion criterion:
intraocular pressure higher than 25 mmHg, or glaucoma

Entity relations:
- Has_value("intraocular pressure", "higher than 25 mmHg")
- OR("intraocular pressure", "glaucoma")